Patients scheduled for supine-positioned elective craniotomy for supratentorial malignant and non-malignant brain tumors 3 cm or larger (measured as the largest diameter in any plane on MR images)

The above is a clinical trial inclusion criterion. Annotated with entity spans:
Patients [Mood: scheduled] for [Procedure: supine-positioned elective craniotomy] for [Qualifier: supratentorial] [Qualifier: malignant] and [Negation: non]-[Qualifier: malignant] [Condition: brain tumors] [Qualifier: 3 cm or larger] (measured as the [Qualifier: largest diameter in any plane] on [Procedure: MR] images)